En un programa de cribado de cáncer de colon, a un paciente de 52 años se le realiza una colonoscopia. Todo el colon es de aspecto normal, salvo el hallazgo de un pólipo pediculado de 2 cm en sigma que se extirpa con asa de diatermia. El resultado anatomopatológico nos indica que existe un carcinoma "in situ" limitado a la cabeza del pólipo. Tiene una TC toracoabdominal informado como normal. Indique cuál sería la conducta correcta a seguir:
1. Resección segmentaria del colon afecto.
2. Vigilancia periódica endoscópica.
3. Resección local de la base del pólipo.
4. Sigmoidectomía más linfadenectomía.

Respuesta correcta: 2. Vigilancia periódica endoscópica.